Availability of tumor biopsy material extracted and preserved by the investigating site.

The above is a clinical trial inclusion criterion. Annotated with entity spans:
[Non-representable: Availability of tumor biopsy material extracted and preserved by the investigating site].